La concepción de persona basada en la idea de que es un ser unido de manera inseparable a su cultura es desarrollada en el modelo de cuidados de:
1. M. E. Rogers.
2. N. J. Pender.
3. J. Watson.
4. M. Leininger.
5. M. K. Chisman y J. Riehl-Sisca.

Respuesta correcta: 4. M. Leininger.